All subjects are written informed consent.

The above is a clinical trial inclusion criterion. Annotated with entity spans:
[Informed_consent: All subjects are written informed consent].